40 歲男性病人因上腹部劇痛 1 天由急診住院。住院時血壓 140/80 mmHg，脈搏每分鐘 92 次。抽血檢查白血球 15,900 /µL，血紅素為 16.6 g/dL，血小板 198,000 /µL，AST 30 IU/L，ALT 24 IU/L，膽紅素為 0.1 mg/dL，澱粉酶 559 IU/L，脂肪酶 2935 IU/L。下列何者為此病人之最佳診斷？
A. 急性心肌梗塞
B. 急性胰臟炎
C. 急性膽囊炎
D. 十二指腸潰瘍

正確答案：B. 急性胰臟炎